一位32歲男性馬拉松選手因為近日常覺得疲倦要求檢查。他五天前剛參加一場比賽，表現並沒有異狀。身體 診察沒有異常，實	室檢查了血色素與甲狀腺促素（TSH），檢查數值都正常。他的太太發現近日他在睡覺時常會打鼾，進行了睡眠檢查沒有發現呼吸中止，但24小時心電圖紀錄，在睡眠當中心跳每分鐘介於42～58 次，清醒時心率則是每分鐘66～78次之間。針對該病人的心跳狀況應採取下列何項處置？
A. 安排住院接受心臟電氣生理檢查
B. 不須治療
C. 轉介安排心率節律器置入
D. 給予頸動脈竇（carotid sinus）按摩

正確答案：B. 不須治療